Immunosuppresant host

The above is a clinical trial exclusion criterion. Annotated with entity spans:
[Condition: Immunosuppresant host]